Lisfranc截肢病患的殘肢不會留有下列那一塊骨頭？
A. 蹠骨（metatarsus）
B. 楔骨（cuneiform）
C. 跟骨（calcaneus）
D. 距骨（talus）

正確答案：A. 蹠骨（metatarsus）